Clinical trial inclusion criterion:
Ability to understand and sign informed consent.

Annotated entities:
- Post-eligibility: "Ability to understand and sign informed consent."